影響心電圖之 ST 節波持續時間的主要離子是：
A. 鈉離子
B. 鈣離子
C. 鉀離子
D. 磷離子

正確答案：B. 鈣離子